Clinical trial inclusion criterion:
Previously treated patients, with failure or intolerance to first-line therapy, or relapse after first-line therapy, i.e. corticosteroids, intravenous immunoglobulin (IVIG), or anti-D immunoglobulins

Annotated entities:
- Observation: "Previously treated"
- Procedure: "first-line therapy"
- Qualifier: "failure"
- Qualifier: "intolerance"
- Condition: "relapse"
- Temporal: "after first-line therapy"
- Reference_point: "first-line therapy"
- Procedure: "first-line therapy"
- Drug: "corticosteroids"
- Drug: "intravenous immunoglobulin"
- Drug: "anti-D immunoglobulins"
- Drug: "IVIG"